Clinical trial exclusion criterion:
previous history of roux-en-y gastric bypass

Entity relations:
- Has_temporal("roux-en-y gastric bypass", "history")
- Has_temporal("roux-en-y gastric bypass", "previous")